Clinical trial exclusion criterion:
Patients have a history of allergy to one component of triple therapy regimen (proton pump inhibitor, penicillin, and / or macrolide) before.

Annotated entities:
- Temporal: "history"
- Condition: "allergy"
- Drug: "component of triple therapy regimen"
- Drug: "proton pump inhibitor"
- Drug: "penicillin"
- Drug: "macrolide"